Participation in another clinical study of an investigational product currently or within the past 90 days, or expected participation during this study

The above is a clinical trial exclusion criterion. Annotated with entity spans:
[Competing_trial: Participation in another clinical study of an investigational product currently or within the past 90 days, or expected participation during this study]